Psoriasis or psoriasis arthropathy

The above is a clinical trial exclusion criterion. Annotated with entity spans:
[Condition: Psoriasis] or [Condition: psoriasis arthropathy]